Clinical trial inclusion criterion:
Males aged 18 years and above

Annotated entities:
- Person: "Males"
- Person: "aged"
- Value: "18 years and above"